obese : weight for height > median + 3 standard deviations

The above is a clinical trial inclusion criterion. Annotated with entity spans:
[Condition: obese] : [Measurement: weight for height] [Value: > median + 3 standard deviations]